新生兒出生後數小時被發現吐出泡沫唾液且上腹部有微脹的現象，下列何項診斷最有可能？
A. 十二指腸閉鎖（duodenal atresia）
B. 食道閉鎖合併遠端氣管食道瘻管（esophageal atresia with distal tracheoesophageal fistula）
C. 中腸扭結（midgut volvulus）
D. 橫膈膜疝氣（diaphragmatic hernia）

正確答案：B. 食道閉鎖合併遠端氣管食道瘻管（esophageal atresia with distal tracheoesophageal fistula）